Infection requiring systemic antibiotic therapy or other serious infection within 14 days before study enrollment.

The above is a clinical trial exclusion criterion. Annotated with entity spans:
[Condition: Infection] requiring [Procedure: systemic antibiotic therapy] or [Qualifier: other] [Qualifier: serious] [Condition: infection] [Temporal: within 14 days before study enrollment].